先天性脊髓脊髓膜膨出症（myelomeningocele）常合併的神經系統異常不包括下列何者？
A. 第二型Arnold Chiari異常
B. 小腦症
C. 脊髓沾黏（tethered cord）
D. 脊髓內脂肪瘤（lipoma）

正確答案：B. 小腦症